1. Expected performance of PCI < 60 minutes from diagnosis (qualifying ECG) or inability to arrive at the catheterisation laboratory within 3 hours

The above is a clinical trial exclusion criterion. Annotated with entity spans:
1. Expected performance of [Device: PCI] [Temporal: < 60 minutes from diagnosis] (qualifying ECG) or [Non-query-able: inability to arrive at the catheterisation laboratory within 3 hours]